Clinical trial exclusion criterion:
Uncorrected hypokalemia or hyperkalemia (potassium <3.5 mmol/l or >5.5 mmol/l).

Annotated entities:
- Condition: "hypokalemia"
- Condition: "hyperkalemia"
- Measurement: "potassium"
- Value: "<3.5 mmol/l"
- Value: ">5.5 mmol/l"